Clinical trial exclusion criterion:
dual organ transplant

Entity relations:
- Has_multiplier("organ transplant", "dual")